Contraindication to weight bearing on lower extremities

The above is a clinical trial exclusion criterion. Annotated with entity spans:
[Condition: Contraindication] to [Observation: weight bearing on lower extremities]